Positive serological tests such as AIDS, hepatitis B virus, hepatitis C virus and syphilis （antigen or antibody）.

The above is a clinical trial exclusion criterion. Annotated with entity spans:
Positive serological tests such as [Condition: AIDS], [Condition: hepatitis B virus], [Condition: hepatitis C virus] [Grammar_Error: and] [Condition: syphilis] （antigen or antibody）.